下列那一條神經受損會造成爪形手（claw hand）的症狀？
A. 肌皮神經（musculocutaneous nerve）
B. 正中神經（median nerve）
C. 尺神經（ulnar nerve）
D. 橈神經（radial nerve）

正確答案：C. 尺神經（ulnar nerve）